Clinical trial inclusion criterion:
Varicose vein tributary requiring treatment

Annotated entities:
- Qualifier: "Varicose vein tributary"
- Mood: "requiring"
- Procedure: "treatment"